下列何者屬於比例尺度資料（ratio scaling data）？
A. 攝氏溫度（如 25℃、-5℃）
B. 宗教信仰（如天主教、道教）
C. 身高（如 165 公分、170 公分）
D. 教育程度（如小學、高中）

正確答案：C. 身高（如 165 公分、170 公分）